Patients presenting with gastroesophageal reflux disease, peptic ulcer.

The above is a clinical trial exclusion criterion. Annotated with entity spans:
Patients presenting with [Condition: gastroesophageal reflux disease], [Condition: peptic ulcer].